一位40歲亞裔女性病人，沒有抽過菸，最近被診斷為非小細胞肺癌第四期，腫瘤有EGFR（epidermal growth  factor receptor）基因突變（exon 19 deletion），下列何種治療最為合適？
A. EGFR抑制劑
B. EGFR抑制劑+化學治療
C. 血管增生抑制抗體
D. EGFR抑制劑+血管增生抑制抗體

正確答案：A. EGFR抑制劑